All subjects with any cardiac disease or history of cardiac arrhythmias will be excluded.

The above is a clinical trial exclusion criterion. Annotated with entity spans:
All subjects with any [Condition: cardiac disease] or [Temporal: history] of [Condition: cardiac arrhythmias] will be excluded.